Subject receiving dopamine agonists, nitrates, alpha-receptor blocking agents, or antihypertensive medication (see other exclusionary medications listed below)

The above is a clinical trial exclusion criterion. Annotated with entity spans:
Subject receiving [Drug: dopamine agonists], [Drug: nitrates], [Drug: alpha-receptor blocking agents], or [Drug: antihypertensive medication] (see other exclusionary medications listed below)